Clinical trial exclusion criterion:
Subject has used non-steroidal anti-inflammatory drugs including aspirin, two times per week, during the 4 weeks preceding enrollment. Low dose aspirin regimens (< 100 mg daily) are acceptable and not exclusionary.

Entity relations:
- Has_index("during the 4 weeks preceding", "enrollment")
- Subsumes("non-steroidal anti-inflammatory drugs", "aspirin")
- Has_multiplier("non-steroidal anti-inflammatory drugs", "two times per week")
- Has_temporal("non-steroidal anti-inflammatory drugs", "during the 4 weeks preceding")
- Has_qualifier("aspirin", "Low dose")
- Has_multiplier("Low dose", "< 100 mg daily")